Unstable and advanced liver disease (as defined by the presence of at least one of the following: ascites, encephalopathy, coagulopathy, hypoalbuminemia, esophageal or gastric varices, or persistent jaundice)

The above is a clinical trial exclusion criterion. Annotated with entity spans:
[Qualifier: Unstable] and [Qualifier: advanced] [Condition: liver disease] (as defined by the presence of [Multiplier: at least one] of the following: [Condition: ascites], [Condition: encephalopathy], [Condition: coagulopathy], [Condition: hypoalbuminemia], [Condition: esophageal] or [Condition: gastric varices], or [Qualifier: persistent] [Condition: jaundice])